Clinical trial exclusion criterion:
A history of life-threatening asthma defined for this protocol as an asthma episode that required intubation, hypercapnea requiring non-invasive ventilatory support, respiratory arrest, hypoxic seizures or asthma-related syncopal episode(s).

Annotated entities:
- Condition: "asthma"
- Qualifier: "life-threatening"
- Temporal: "history"
- Procedure: "intubation"
- Condition: "asthma episode"
- Condition: "hypercapnea"
- Device: "non-invasive ventilatory support"
- Condition: "respiratory arrest"
- Condition: "hypoxic seizures"
- Condition: "asthma-related syncopal episode"